Clinical trial exclusion criterion:
renal failure

Annotated entities:
- Condition: "renal failure"